21歲女性，無過去病史。3天前開始發燒、咳嗽。今天門診就診時仍有發燒，且呼吸較急促、呼吸時胸痛。意識清楚，血壓 100/70 mmHg，脈搏100 bpm，呼吸24 bpm，耳溫 9℃，左下肺葉扣診濁音（dullness），胸部X光顯示左下肺葉浸潤，診斷為肺炎。在社區門診應給予何種處置最適當？
A. 應先進行血液培養才可給予抗生素
B. 痰液培養務必執行
C. 可優先選用Azithromycin治療
D. 可優先選用Moxifloxacin治療

正確答案：C. 可優先選用Azithromycin治療